El pH que proporciona una disolución 0.01 M de ácido benzoico (pKa=4.2) es:
1. 1.1.
2. 2.1.
3. 3.1.
4. 4.1.
5. 4.2.

Respuesta correcta: 3. 3.1.